Subjects unlikely to cooperate in the study or with inability or unwillingness to give informed consent.

The above is a clinical trial exclusion criterion. Annotated with entity spans:
S[Post-eligibility: ubjects unlikely to cooperate in the study or with inability or unwillingness to give informed consent].